Known prior stroke or TIA

The above is a clinical trial exclusion criterion. Annotated with entity spans:
Known prior [Condition: stroke] or [Condition: TIA]